使用濾紙紙條，放置於外三分之一的結膜穹窿處，測量病人的淚液分泌量。這種檢查稱為什麼？
A. 淚液層裂解時間（tear film break-up time）
B. Sjögren test
C. Schirmer test
D. Amsler grid

正確答案：C. Schirmer test